Clinical trial exclusion criterion:
Known hypersensitivity to paracetamol or mannitol (excipient with known effect)

Entity relations:
- AND("hypersensitivity", "paracetamol")
- OR("paracetamol", "mannitol")